一位 19 歲男性，早上全身無力被送至急診。病人過去沒有肌肉無力的病史，且前一天晚上在同學的生日會上還可跳舞，吃了很多蛋糕也都沒有嗆到；雖然最近食量大增，體重也沒有增加。參加宴會的其他人及家人也都沒有肌肉無力的症狀，病人的肌腱反射下降，感覺系統則正常。下列那一個器官的功能異常與病人的症狀最相關？
A. 甲狀腺
B. 胸腺
C. 腎上腺皮質
D. 肝臟

正確答案：A. 甲狀腺